Renal diseases;

The above is a clinical trial exclusion criterion. Annotated with entity spans:
[Condition: Renal diseases];